某職業病醫師調查某工廠勞工吃檳榔和口腔疾病的相關性，總共有 150 位員工接受調查，110 位有吃檳榔習慣的員工中 80 位罹患口腔疾病；而 40 位沒有此習慣的員工中 4 位罹患口腔疾病，則吃檳榔者口腔疾病的勝算比（odds ratio）為：
A. 24.0
B. 7.3
C. 3.4
D. 1.2

正確答案：A. 24.0